過敏原和抗原特異性的 IgE 結合後如何活化肥大細胞（mast cells）？
A. 經由補體接受體被吞噬到肥大細胞內
B. 經由 B 細胞表面的抗體刺激 B 細胞產生更多 IgE
C. 經由肥大細胞表面的 IgE 接受體傳訊息到細胞內
D. 黏著到樹突細胞上的 MHC 分子刺激 T 細胞產生 IL-4

正確答案：C. 經由肥大細胞表面的 IgE 接受體傳訊息到細胞內